La ecuación de Arrhenius:
1. Relaciona la velocidad de una reacción química con la llamada constante de velocidad y con las concentraciones de los reactivos elevadas a sus coeficientes estequiométricos.
2. Relaciona la constante de velocidad de una reacción química con la energía de activación de dicha reacción, de modo que si la energía, de activación es alta la reacción es rápida.
3. Se cumple únicamente para reacciones unimoleculares.
4. Relaciona la constante de velocidad con la temperatura a través de la energía de activación y el factor pre-exponencial.
5. Permite obtener la energía de activación de una reacción elemental con sólo representar el logaritmo decimal de la temperatura frente al inverso del tiempo de reacción.

Respuesta correcta: 4. Relaciona la constante de velocidad con la temperatura a través de la energía de activación y el factor pre-exponencial.